ASA I - II

The above is a clinical trial inclusion criterion. Annotated with entity spans:
[Measurement: ASA] [Value: I - II]